3歲大的兒童，門診的身體診察發現此病童頭圍小，戴助聽器，只能說出簡單的詞彙，而無法說出短句，其它的身體診察正常。其出生史為足月自然產並合併黃疸及血小板過低。本次電腦斷層檢查發現腦室周圍有鈣化。根據以上資訊下列那一種先天性感染疾病最有可能？
A. 梅毒（Syphilis）
B. 弓漿蟲病（Toxoplasmosis）
C. 疱疹病毒（Herpes simplex virus infection）
D. 巨細胞病毒感染（Cytomegalovirus infection）

正確答案：D. 巨細胞病毒感染（Cytomegalovirus infection）